Currently taking aspirin or a statin.

The above is a clinical trial exclusion criterion. Annotated with entity spans:
Currently taking [Drug: aspirin] or a [Drug: statin].